在 100 公尺短跑中，下列何者為肌肉前 4 秒主要的能源？
A. anaerobic metabolism of glucose
B. aerobic metabolism of glucose
C. creatine phosphate
D. ketone bodies

正確答案：C. creatine phosphate